Clinical trial exclusion criterion:
17. Subjects unwilling to use acceptable methods of contraception.

Annotated entities:
- Parsing_Error: "17."
- Condition: "unwilling"
- Qualifier: "acceptable"
- Procedure: "contraception"